patients who have drugs contraindications

The above is a clinical trial exclusion criterion. Annotated with entity spans:
patients who have [Drug: drugs] [Condition: contraindications]